Clinical trial inclusion criterion:
Healthy subjects as established by medical history and clinical examination before entering into the study. Healthy subjects with no medical conditions that, in the opinion of the investigator, prevents the subject from participating in the study.

Annotated entities:
- Condition: "Healthy"
- Temporal: "medical history"
- Procedure: "clinical examination"
- Temporal: "before entering into the study"
- Reference_point: "entering into the study"
- Non-query-able: "Healthy subjects with no medical conditions that, in the opinion of the investigator, prevents the subject from participating in the study."